Los receptores de tipo Toll (TLRs) reconocen de manera principal:
1. Proteínas.
2. Superantígenos.
3. Antígenos de histocompatibilidad no polimórficos.
4. Diversos componentes de los microbios.
5. Tolerógenos.

Respuesta correcta: 4. Diversos componentes de los microbios.